Clinical trial inclusion criterion:
colorectal cancer above to 12 cm from the anal verge

Entity relations:
- Has_qualifier("colorectal cancer", "above to 12 cm from the anal verge")